Clinical trial inclusion criterion:
Patients who previously have received a liver transplant over the last six months and within last three years.

Entity relations:
- Has_temporal("liver transplant", "last six months and within last three years")